下述何種腰椎疾病，最為適合以經脊椎骨弓螺釘固定及脊椎後側融合術（Transpedic screws and  posteriolateral fusion）來治療？
A. 腰椎面關節病（Facet arthropathy）
B. 腰椎骨脫位（Spondylolithiasis）
C. 腰椎管狹窄（Stenosis）
D. 腰椎間盤突出（Disc protruding）

正確答案：B. 腰椎骨脫位（Spondylolithiasis）